Clinical trial exclusion criterion:
Pregnant or breast-feeding women

Annotated entities:
- Condition: "Pregnant"
- Condition: "breast-feeding women"